Clinical trial inclusion criterion:
If HBV DNA is positive, the subject is ineligible.

Annotated entities:
- Measurement: "HBV DNA"
- Value: "positive"
- Grammar_Error: "If HBV DNA is positive, the subject is ineligible"